Clinical trial inclusion criterion:
Diagnosis of asthma

Annotated entities:
- Condition: "asthma"